¿Qué puede derivarse de los estudios empíricos que analizan la relación entre número de observaciones y aparición de conductas de ayuda?:
1. La conducta de ayuda disminuye cuando aumenta el número de observadores.
2. La conducta de ayuda no se ve afectada por el número de observadores.
3. La conducta de ayuda aumenta cuando lo hace el número de observadores.
4. No existen resultados consistentes que permitan extraer conclusiones sobre la relación entre ambas variables.

Respuesta correcta: 1. La conducta de ayuda disminuye cuando aumenta el número de observadores.